Clinical trial inclusion criteria:
Recently diagnosed type 2 diabetic patients.
Fasting plasma glucose between 200-300 mg/dl (A1C level between 7% and 10%).
Those who age between 30 and 80 years old and can inject insulin by themselves.

Annotated entities:
- Condition: "type 2 diabetic"
- Temporal: "Recently diagnosed"
- Measurement: "Fasting plasma glucose"
- Value: "between 200-300 mg/dl"
- Measurement: "A1C level"
- Value: "between 7% and 10%"
- Value: "between 30 and 80 years old"
- Person: "age"
- Observation: "can"
- Procedure: "inject insulin"